Supervision available for study medication

The above is a clinical trial inclusion criterion. Annotated with entity spans:
[Non-query-able: Supervision available for study medication]